Clinical trial inclusion criterion:
English or Spanish speaking

Annotated entities:
- Observation: "English speaking"
- Observation: "Spanish speaking"